Clinical trial inclusion criterion:
6. ECOG performance status of 0 to 2

Entity relations:
- Has_value("ECOG performance status", "0 to 2")